Clinical trial exclusion criterion:
Ongoing hormone replacement therapy;

Entity relations:
- Has_temporal("hormone replacement therapy", "Ongoing")